What are the symptoms of an incidental durotomy (ID).

Incidental durotomy can cause postural headaches, nausea, vomiting, dizziness, photophobia, tinnitus, and vertigo.